On multiple daily insulin injections, including basal long-acting insulin and rapid-acting insulin before each meal.

The above is a clinical trial inclusion criterion. Annotated with entity spans:
On multiple [Qualifier: daily] [Drug: insulin] injections, including [Qualifier: basal long-acting] [Drug: insulin] and [Qualifier: rapid-acting] [Drug: insulin] before each meal.